一位 40 歲男性病人，因腹水日漸加重而住院，其 serum-ascites albumin gradient（SAAG）＜1.1，下列診斷，何者最有可能？
A. 肝硬化
B. 心衰竭
C. Budd-Chiari syndrome
D. 腎病症候群

正確答案：D. 腎病症候群